Clinical trial inclusion criterion:
Patients with biopsy-proven metastatic carcinoid tumors or other neuroendocrine tumors (Islet cell, Gastrinomas and VIPomas) with at least one measurable lesion (other than bone) that has either not been previously irradiated or if previously irradiated has demonstrated progression since the radiation therapy

Annotated entities:
- Condition: "metastatic carcinoid tumors"
- Value: "proven"
- Procedure: "biopsy"
- Condition: "other neuroendocrine tumors"
- Condition: "Islet cell"
- Condition: "Gastrinomas"
- Condition: "VIPomas"
- Condition: "measurable lesion"
- Qualifier: "bone"
- Procedure: "irradiated"
- Procedure: "irradiated"
- Observation: "progression"
- Procedure: "radiation therapy"
- Temporal: "since the radiation therapy"
- Negation: "not been"
- Reference_point: "radiation therapy"
- Negation: "other than"